Immunocompromised subject

The above is a clinical trial exclusion criterion. Annotated with entity spans:
[Condition: Immunocompromised] subject